Clinical trial inclusion criterion:
ECOG performance status < 2

Annotated entities:
- Measurement: "ECOG performance status"
- Value: "< 2"